一般來說，當採取 laparoscopic choledochotomy 來摘除 common bile duct stone 時，總膽管的直徑最好不要小於多少 mm？
A. 4
B. 6
C. 8
D. 10

正確答案：B. 6